Clinical trial exclusion criterion:
1. Resisted hypertension

Annotated entities:
- Parsing_Error: "1."
- Condition: "Resisted hypertension"